攝護腺癌的根除手術會引起勃起功能障礙，所以手術中泌尿外科醫師會注意那部分組織的保留，來 維護病人的性功能？
A. 海綿體動脈
B. 海綿體靜脈
C. 勃起相關神經
D. 海綿體組織

正確答案：C. 勃起相關神經